Clinical trial exclusion criterion:
3. Clinical evidence of severe bleeding disorder. Patients with mild bleeding disorders such as type 1 von Willebrand disease, mild platelet function defects such as platelet storage pool or release defects, and patients with bleeding due to Ehlers Danlos syndrome WILL be eligible to participate in the study.

Annotated entities:
- Condition: "bleeding disorder"
- Condition: "bleeding disorders"
- Condition: "type 1 von Willebrand disease"
- Condition: "mild platelet function defects"
- Condition: "platelet storage pool defects"
- Condition: "platelet release defects"
- Condition: "Ehlers Danlos syndrome"
- Grammar_Error: "WILL be eligible"
- Condition: "bleeding"
- Qualifier: "severe"
- Undefined_semantics: "severe"
- Qualifier: "mild"
- Undefined_semantics: "mild"